Los ésteres del ácido ascórbico se emplean en Tecnología farmacéutica como:
1. Reductores.
2. Bloqueantes.
3. Sinérgicos.
4. Quelantes.
5. Antisépticos.

Respuesta correcta: 2. Bloqueantes.